李先生於冠狀動脈繞道手術後 4 小時，心跳 130 次／分鐘，呼吸 14 次／分鐘，血壓 90/50 mmHg，中心靜脈壓 4 mmHg，胸管血流量二小時達 600cc，有逐漸增加趨勢。身體評估發現肺泡音正常、心音正常，胸部傷口有滲出血水量多，下肢冰冷。下列何項敘述或處置正確？①李先生可能處於體溫過低活動性出血狀態 ②李先生可能處於活動性出血狀態 ③給予強心劑，增加心肌收縮力 ④通知心臟外科醫師是需要的
A. ①②③
B. 僅①③
C. ②④
D. 僅④

正確答案：C. ②④